Ability to understand and the willingness to sign a written informed consent document

The above is a clinical trial inclusion criterion. Annotated with entity spans:
[Post-eligibility: Ability to understand and the willingness to sign a written informed consent document]